Refusal to participate in the study

The above is a clinical trial exclusion criterion. Annotated with entity spans:
[Post-eligibility: Refusal to participate in the stud]y